Clinical trial inclusion criterion:
Study eye with clinically significant diabetic macular edema (DME) with central subfield thickness ≥ 350µm on spectral domain OCT

Annotated entities:
- Condition: "diabetic macular edema (DME)"
- Qualifier: "clinically significant"
- Measurement: "central subfield thickness"
- Value: "≥ 350µm"
- Procedure: "spectral domain OCT"